Clinical trial exclusion criterion:
non-reassuring fetal status

Annotated entities:
- Condition: "fetal status"
- Qualifier: "non-reassuring"